關於自體免疫溶血性貧血（autoimmune hemolytic anemia），下列敘述何者錯誤？
A. 抗體可分成「冷型抗體（cold antibodies）」與「溫型抗體（warm antibodies）」
B. 在 warm antibody hemolysis，大部分案例是 idiopathic
C. 「Evans syndrome」為自體免疫溶血性貧血合併嗜中性球低下
D. 自體免疫溶血性貧血要小心 SLE 的可能性

正確答案：C. 「Evans syndrome」為自體免疫溶血性貧血合併嗜中性球低下